有關馬爾他布魯氏菌（Brucella melitensis）的特徵，下列何者錯誤？
A. 為兼性厭氧菌（facultative anaerobic）
B. 是波浪熱（undulant fever）的致病菌
C. 為革蘭氏陰性桿菌
D. 可在巨噬細胞（macrophages）內生長

正確答案：A. 為兼性厭氧菌（facultative anaerobic）